Clinical trial inclusion criterion:
community-acquired pneumonia: the presence of radiologically confirmed infiltration of the lung tissue; the presence of at least two of the following clinical signs: acute fever early in the disease (temperature > 38.0°C), cough with sputum, the physical signs of pneumonia (focus of crepitate and/or fine bubble rales, bronchial breathing hard, shortening of percussion sounds), leukocytosis > 10*10 9 /l and/or stab shift > 10%; the occurrence of the disease outside the hospital and the organized groups (such as nursing homes, sanatoriums, etc.).

Entity relations:
- multi("radiologically confirmed", "radiologically")
- Has_qualifier("infiltration of the lung tissue", "radiologically confirmed")
- Has_value("temperature", "> 38.0°C")
- Subsumes("acute fever", "temperature")
- Has_temporal("acute fever", "early in the disease")
- AND("physical signs", "pneumonia")
- Subsumes("physical signs", "crepitate rales")
- Has_value("stab shift", "> 10%")
- Has_value("leukocytosis", "> 10*10 9 /l")
- Has_multiplier("acute fever", "at least two")
- Subsumes("community-acquired pneumonia", "infiltration of the lung tissue")
- OR("crepitate rales", "bronchial breathing hard", "fine bubble rales", "shortening of percussion sounds")
- OR("crepitate rales", "stab shift", "leukocytosis")
- OR("acute fever", "cough with sputum", "physical signs")
- OR("infiltration of the lung tissue", "acute fever")